Clinical trial exclusion criterion:
Has Presbyopia or has dependence on spectacles for near work over the contact lenses.

Entity relations:
- OR("Presbyopia", "dependence on spectacles for near work")